Clinical trial exclusion criterion:
Restenosis

Annotated entities:
- Condition: "Restenosis"